Adult (= 18 years old) subjects with chronic genotype 1 HCV and NCI with a GDS greater than or equal to 0.5 (n=60).

The above is a clinical trial inclusion criterion. Annotated with entity spans:
[Person: Adult] ([Value: = 18 years old]) subjects with [Temporal: chronic] [Qualifier: genotype 1] [Condition: HCV] and [Condition: NCI] with a [Measurement: GDS] [Value: greater than or equal to 0.5] (n=60).